有關人體腎臟對血漿滲透度調節（osmolar regulation）的敘述，下列何者錯誤？
A. 血漿滲透度（plasma osmolality）值大於 280 mOsm/kg H2O 後會刺激抗利尿荷爾蒙（antidiuretic hormone）分泌
B. 刺激口渴的血漿滲透度閾值（threshold）要比刺激抗利尿荷爾蒙分泌之閾值高
C. 抗利尿荷爾蒙使遠端腎小管對水分子不易重吸收
D. 尿液濃縮時其尿液滲透度值最高可至 1200 mOsm/kg H2O，而尿液稀釋時其尿液滲透度值最低可至50 mOsm/kg H2O

正確答案：C. 抗利尿荷爾蒙使遠端腎小管對水分子不易重吸收